Sex for exchange of money, goods or services

The above is a clinical trial inclusion criterion. Annotated with entity spans:
[Observation: Sex for exchange of money, goods or services]